Señale la afirmación correcta. Sobre cuestiones normativas en materia de vacunación en el territorio español diremos que:
1. La vacunación es obligada cuando la marca el Consejo Interterritorial del Sistema Nacional de Salud a nivel estatal, pero de carácter voluntario si la marcan las comunidades autónomas.
2. La vacunación infantil es obligada si la marca el Consejo Interterritorial del Sistema Nacional de Salud, para lograr la protección a la infancia como objetivo internacional de la Organización Mundial de la Salud.
3. La vacunación no posee carácter de obligatoriedad salvo en caso de epidemia, cuando existe un riesgo colectivo para la salud pública. En ese caso es legalmente posible imponer la vacunación.
4. La voluntariedad en la vacunación no tiene excepciones legales y es independiente a las situaciones que se den.

Respuesta correcta: 3. La vacunación no posee carácter de obligatoriedad salvo en caso de epidemia, cuando existe un riesgo colectivo para la salud pública. En ese caso es legalmente posible imponer la vacunación.